Clinical trial exclusion criteria:
Apnea-hypopnea index of less than 5 h-1 or greater than 30 h-1.
Predominance of central apneas and hypopneas, defined as more than 25% of all respiratory events.
Professional drivers, risk profession or respiratory failure (according to criteria of the clinical pathway for diagnosis and treatment of sleep-disordered breathing).
Very excessive daytime sleepiness (Epworth Sleepiness Scale> 18).
Morbid obesity (BMI> 40 kg / m2).
Prior treatment with CPAP.

Annotated entities:
- Measurement: "Apnea-hypopnea index"
- Value: "less than 5 h-1 or greater than 30 h-1"
- Condition: "central apneas and hypopneas"
- Value: "more than 25%"
- Measurement: "all respiratory events"
- Condition: "Predominance"
- Person: "Professional drivers"
- Person: "risk profession"
- Condition: "respiratory failure"
- Procedure: "criteria of the clinical pathway for diagnosis and treatment of sleep-disordered breathing"
- Qualifier: "Very excessive"
- Condition: "daytime sleepiness"
- Measurement: "Epworth Sleepiness Scale"
- Value: "> 18"
- Condition: "Morbid obesity"
- Measurement: "BMI"
- Value: "> 40 kg / m2"
- Procedure: "CPAP"
- Temporal: "Prior"